關於異位性皮膚炎（atopic dermatitis）的處置，下列何者錯誤？
A. 外用局部皮質類固醇藥劑
B. 紫外線光照治療
C. 使用潤膚劑
D. 外用維生素D3及其衍生物

正確答案：D. 外用維生素D3及其衍生物